夏柯馬利疾病（Charcot-Marie-Tooth disease）所產生周邊神經病變，容易造成下肢的變形，其中那一種神經最容易被侵犯？
A. 腓神經（peroneal nerve）
B. 脛骨神經（tibial nerve）
C. 股神經（femoral nerve）
D. 隱神經（saphenous nerve）

正確答案：A. 腓神經（peroneal nerve）